Cigarette smoking

The above is a clinical trial exclusion criterion. Annotated with entity spans:
[Condition: Cigarette smoking]